autonomic dysfunction

The above is a clinical trial exclusion criterion. Annotated with entity spans:
[Condition: autonomic dysfunction]